Clinically significant abnormal laboratory result or physical examination finding not resolved by the time of baseline assessments.

The above is a clinical trial exclusion criterion. Annotated with entity spans:
[Non-query-able: Clinically significant abnormal laboratory result or physical examination finding not resolved by the time of baseline assessments].